Clinical trial inclusion criteria:
Pregnant patients who require a scheduled or non-urgent cesarean birth
Patient able to receive neuraxial analgesia
Patient able to give verbal and written consent for both cesarean birth and study

Annotated entities:
- Condition: "Pregnant"
- Qualifier: "scheduled"
- Qualifier: "non-urgent"
- Procedure: "cesarean birth"
- Procedure: "neuraxial analgesia"
- Mood: "able to receive"
- Informed_consent: "Patient able to give verbal and written consent for both cesarean birth and study"